Clinical trial inclusion criterion:
Written informed consent and/or, written informed assent as required

Annotated entities:
- Observation: "Written informed consent"
- Observation: "written informed assent"